How many cysteines have alpha-defensins?

Alpha defensins contain six cysteines, which form three well defined disulfide bridges under oxidizing conditions.